Clinical trial exclusion criterion:
Myocardial infarct, cerebrovascular accident, sepsis, respiratory failure, or severe intercurrent illness within the previous 6 weeks

Entity relations:
- Has_qualifier("intercurrent illness", "severe")
- Has_temporal("Myocardial infarct", "within the previous 6 weeks")
- OR("Myocardial infarct", "respiratory failure", "intercurrent illness", "cerebrovascular accident", "sepsis")